Clinical trial exclusion criterion:
Pregnant women and infants;

Annotated entities:
- Condition: "Pregnant"
- Person: "women"
- Person: "infants"